Body weight = 140 kg

The above is a clinical trial inclusion criterion. Annotated with entity spans:
[Measurement: Body weight] [Value: = 140 kg]